最常見於蛋白質之三級結構內部的共價交互作用為：
A. 氫鍵（Hydrogen bond）
B. 凡德瓦爾力（van der Waals interaction）
C. 離子交互作用（Ionic interaction）
D. 雙硫鍵（Disulfide bond）

正確答案：D. 雙硫鍵（Disulfide bond）